Clinical trial exclusion criteria:
history of major systemic illness, including uncontrolled hypertension, diabetes, chronic renal insufficiency, autoimmune diseases or malignancies
history of neurological disorders which might affect sensation such as previous stroke or peripheral neuropathy
history of substance abuse (except painkillers)
heavy smokers (with a daily consumption >20 cigarettes)
pregnancy or lactation
any contraindication for magnetic resonance imaging (MRI)
and any obvious infection or inflammation over a period of at least 1 month before the study.

Annotated entities:
- Condition: "systemic illness"
- Qualifier: "major"
- Condition: "hypertension"
- Qualifier: "uncontrolled"
- Condition: "diabetes"
- Condition: "chronic renal insufficiency,"
- Condition: "autoimmune diseases"
- Condition: "malignancies"
- Condition: "neurological disorders"
- Condition: "stroke"
- Condition: "peripheral neuropathy"
- Condition: "affect sensation"
- Condition: "substance abuse"
- Negation: "except"
- Drug: "painkillers"
- Qualifier: "heavy"
- Person: "smokers"
- Observation: "cigarettes"
- Multiplier: "daily consumption >20"
- Pregnancy_considerations: "pregnancy or lactation"
- Condition: "contraindication"
- Procedure: "magnetic resonance imaging"
- Procedure: "MRI"
- Condition: "infection"
- Condition: "inflammation"
- Temporal: "at least 1 month before the study"
- Reference_point: "study"
- Qualifier: "obvious"